Patients with major psychiatric illness.

The above is a clinical trial exclusion criterion. Annotated with entity spans:
Patients with [Condition: major psychiatric illness].